Patients with chronic liver disease

The above is a clinical trial exclusion criterion. Annotated with entity spans:
Patients with [Condition: chronic liver disease]